resection must have been macroscopically complete laterally,

The above is a clinical trial inclusion criterion. Annotated with entity spans:
[Condition: resection] must have been [Qualifier: macroscopically complete laterally],